Clinical trial exclusion criterion:
Known hypersensitivity or contraindication to any of the following medications: heparin, aspirin, clopidogrel or contrast agents

Entity relations:
- Subsumes("hypersensitivity", "heparin")
- OR("hypersensitivity", "contraindication")
- OR("heparin", "clopidogrel", "aspirin", "contrast agents")